婦科腫瘤會與有些血清、生化或免疫染色的腫瘤標記（tumor markers）有所關聯，下列敘述何者正確？
A. sarcoma 之組織鑑別標記可用 S-100
B. vimentin 代表是 non-mesenchymal tissue
C. adenocarcinoma 可以 CA-125 為血清標記
D. LDH 是卵巢 stromal tumor 之標記

正確答案：C. adenocarcinoma 可以 CA-125 為血清標記